11. Systolic blood pressure <85 or diastolic blood pressure <55

The above is a clinical trial exclusion criterion. Annotated with entity spans:
11. [Measurement: Systolic blood pressure] [Value: <85] or [Measurement: diastolic blood pressure] [Value: <55]